在心動週期中，主動脈瓣膜的關閉，發生於下列那一階段？
A. 等體積心室收縮期（isovolumetric contraction）
B. 等體積心室舒張期（isovolumetric relaxation）
C. 心室快速充血期（rapid filling）
D. 心室快速射血期（rapid ejection）

正確答案：B. 等體積心室舒張期（isovolumetric relaxation）